Has no history of untreated latent or active tuberculosis (TB) prior to Screening

The above is a clinical trial inclusion criterion. Annotated with entity spans:
Has [Negation: no] [Temporal: history] of [Qualifier: untreated] [Qualifier: latent] or [Qualifier: active] [Condition: tuberculosis (TB)] [Temporal: prior to Screening]